¿Cuál es el tumor maligno más frecuente del tiroides?
1. Carcinoma oxifílico.
2. Carcinoma papilar.
3. Carcinoma folicular.
4. Carcinoma anaplásico.
5. Carcinoma medular.

Respuesta correcta: 2. Carcinoma papilar.